Patients able to provide consent to study participation

The above is a clinical trial inclusion criterion. Annotated with entity spans:
[Post-eligibility: Patients able to provide consent to study participation]